Plaque psoriasis with =2% Body Surface Area (BSA) involvement (may include scalp involvement), PASI Score = 2, IGA mod 2011 score of 2 or greater (based on scale of 0-4)

The above is a clinical trial inclusion criterion. Annotated with entity spans:
[Condition: Plaque psoriasis] with [Value: =2% Body Surface Area (BSA)] [Measurement: involvement] (may include scalp involvement), [Measurement: PASI Score] [Value: = 2], [Measurement: IGA mod 2011 score] of [Value: 2 or greater] (based on [Qualifier: scale of 0-4])